Clinical trial exclusion criterion:
History of drug sensitivity or allergic reaction to alpha-blockers or beta-blockers

Annotated entities:
- Temporal: "History"
- Condition: "drug sensitivity"
- Condition: "allergic reaction"
- Drug: "alpha-blockers"
- Drug: "beta-blockers"